Clinical trial exclusion criterion:
Neurological or medical conditions that would interfere with MRI scanning (e.g. history of stroke, seizure, brain tumor, brain infection, traumatic brain injury, multiple sclerosis, dementia, metal device in body, pregnancy, claustrophobia, color blindness, severe hearing impairment, weight>300 lbs., wheelchair-bound)

Annotated entities:
- Condition: "medical conditions"
- Condition: "conditions Neurological"
- Condition: "interfere"
- Procedure: "MRI scanning"
- Condition: "stroke"
- Condition: "seizure"
- Condition: "brain tumor"
- Condition: "brain infection"
- Condition: "traumatic brain injury"
- Condition: "multiple sclerosis"
- Condition: "dementia"
- Device: "metal device in body"
- Condition: "pregnancy"
- Condition: "claustrophobia"
- Condition: "color blindness"
- Condition: "hearing impairment"
- Qualifier: "severe"
- Measurement: "weight"
- Value: ">300 lbs."
- Condition: "wheelchair-bound"